a high cardiovascular risk and LDL-cholesterol> 2.5 mmol / l

The above is a clinical trial inclusion criterion. Annotated with entity spans:
a [Qualifier: high] [Condition: cardiovascular risk] and [Measurement: LDL-cholesterol][Value: > 2.5 mmol / l]